Clinical trial inclusion criterion:
Diagnosed or told by a clinician that they have any of the following bipolar spectrum disorders (BSD): bipolar I, bipolar II, unspecified bipolar and related disorders, Disruptive Mood Dysregulation Disorder (DMDD), cyclothymic disorder, other specified bipolar and related disorders, as well as mood disorder not otherwise specified (if diagnosed in the past as per DSM-IV);

Entity relations:
- Subsumes("bipolar spectrum disorders", "BSD")
- Subsumes("Disruptive Mood Dysregulation Disorder", "DMDD")
- Subsumes("bipolar spectrum disorders", "bipolar I")
- OR("bipolar I", "bipolar II", "unspecified bipolar and related disorders", "Disruptive Mood Dysregulation Disorder", "cyclothymic disorder", "other specified bipolar and related disorders", "mood disorder not otherwise specified")